Clinical trial inclusion criterion:
Patients with de novo stenotic lesions who are suitable for coronary stenting with drug-eluting stent

Annotated entities:
- Qualifier: "de novo"
- Condition: "stenotic lesions"
- Mood: "suitable"
- Procedure: "coronary stenting"
- Device: "drug-eluting stent"